Ongoing or active systemic infection, active hepatitis B or C virus infection, or known human immunodeficiency virus positive.

The above is a clinical trial exclusion criterion. Annotated with entity spans:
[Temporal: Ongoing] or [Qualifier: active] [Condition: systemic infection], [Qualifier: active] [Condition: hepatitis B] or [Condition: C virus infection], or known [Measurement: human immunodeficiency virus] [Value: positive].